Clinical trial exclusion criterion:
Sever liver impairment (liver failure)

Entity relations:
- Subsumes("liver impairment", "liver failure")
- Has_qualifier("liver impairment", "Sever")